Clinical trial inclusion criterion:
Schirmer-1 test >5 mm after 5 min

Entity relations:
- Has_value("Schirmer-1 test", ">5 mm")
- Has_temporal("Schirmer-1 test", "after 5 min")